African American race

The above is a clinical trial inclusion criterion. Annotated with entity spans:
[Value: African American] [Person: race]